History of blood clotting or bleeding abnormalities

The above is a clinical trial exclusion criterion. Annotated with entity spans:
History of [Condition: blood clotting] or [Condition: bleeding abnormalities]